Over the age of 80

The above is a clinical trial exclusion criterion. Annotated with entity spans:
[Value: Over] the [Person: age] of 80